Adult (>18 years of age and older) patients who have or will have undergone surgical resection or biopsy of a supratentorial brain tumor and are able to consent for themselves.

The above is a clinical trial inclusion criterion. Annotated with entity spans:
[Person: Adult] (>18 years of [Person: age] [Value: and older]) patients who have or [Mood: will have undergone] [Procedure: surgical resection] or [Procedure: biopsy] of a [Condition: supratentorial brain tumor] and [Informed_consent: are able to consent for themselves].